Clinical trial inclusion criterion:
Patient aged 18 ans or more

Annotated entities:
- Person: "aged"
- Value: "18 ans or more"